Clinical trial inclusion criterion:
The planned procedure can be any of the following: For diagnostic purposes (coronary angiography only, left catheterization, left and right catheterization). For therapeutic purposes: percutaneous coronary intervention (PCI), with or without stent placement.

Annotated entities:
- Procedure: "procedure"
- Qualifier: "diagnostic"
- Procedure: "coronary angiography"
- Qualifier: "only"
- Procedure: "left catheterization"
- Procedure: "left catheterization"
- Procedure: "right catheterization"
- Procedure: "coronary angiography"
- Procedure: "coronary angiography"
- Qualifier: "therapeutic"
- Procedure: "percutaneous coronary intervention"
- Procedure: "PCI"
- Procedure: "stent placement"